Clinical trial exclusion criterion:
Age less than 14 years

Entity relations:
- Has_value("Age", "less than 14 years")